Cervical length of 15-25 mm by transvaginal sonography (TVS) at 16-24 weeks of gestation.

The above is a clinical trial inclusion criterion. Annotated with entity spans:
[Measurement: Cervical length] of [Value: 15-25 mm] by [Procedure: transvaginal sonography (TVS)] [Temporal: at 16-24 weeks of gestation].